Previous or concurrent hormonal management of prostate cancer

The above is a clinical trial exclusion criterion. Annotated with entity spans:
Previous or concurrent [Procedure: hormonal management] of [Condition: prostate cancer]